El fluoruro de calcio es un sólido blanco que se encuentra como tal en la naturaleza (espato flúor o fluorita, que puede presentarse en muchos colores) y que se emplea como importante fuente de flúor. Entre sus propiedades físicas y químicas destacan:
1. Su solubilidad en agua, que le diferencia de los demás fluoruros del grupo 2.
2. Su resistencia al ácido sulfúrico concentrado.
3. Su hidrólisis en agua, que le transforma en CaO y HF.
4. Su punto de fusión relativamente bajo para un mineral.
5. Su favorable, aunque lenta, oxidación al aire.

Respuesta correcta: 4. Su punto de fusión relativamente bajo para un mineral.